Clinical trial inclusion criterion:
(3) women have experienced two or more implantation failure attributed to inadequate endometrial development.

Annotated entities:
- Person: "women"
- Multiplier: "two or more"
- Procedure: "implantation"
- Qualifier: "failure"
- Condition: "inadequate endometrial development"
- Mood: "attributed to"